Clinical trial exclusion criterion:
Thrombocytosis > 750K

Entity relations:
- Has_value("Thrombocytosis", "> 750K")